Clinical trial exclusion criterion:
22. Clinically unacceptable result at the screening physical examination

Annotated entities:
- Parsing_Error: "22."
- Condition: "Clinically unacceptable result"
- Temporal: "at the screening physical examination"
- Reference_point: "the screening physical examination"
- Procedure: "physical examination"
- Qualifier: "Clinically unacceptable"
- Subjective_judgement: "Clinically unacceptable"
- Undefined_semantics: "Clinically unacceptable result"